Clinical trial inclusion criterion:
Patient is pregnant, lactating, or planning to become pregnant within 12 months

Annotated entities:
- Condition: "pregnant"
- Condition: "lactating"
- Mood: "planning to become"
- Condition: "pregnant"
- Temporal: "within 12 months"